目前分析人類基因（variant alleles）與自體免疫疾病致病性之相關，是查出此基因在某自體免疫疾病病患者中的存在比例，再與根據於一般族群之期望值做比較，而得到本基因（variant alleles）在自體免疫致病性之 「相對危險值」（relative risk）。目前查出有較高的「相對危險值」的基因類別為下列那一項？
A. 人類白血球抗原（human leukocyte antigens）基因
B. GM-CSF基因
C. CD4基因
D. Small GTP-binding protein cdc42基因

正確答案：A. 人類白血球抗原（human leukocyte antigens）基因